Allergy or intolerance to clonidine

The above is a clinical trial exclusion criterion. Annotated with entity spans:
[Condition: Allergy] or [Condition: intolerance] to [Drug: clonidine]